Clinical trial inclusion criterion:
current diagnosis of narcolepsy with cataplexy OR healthy control

Entity relations:
- AND("narcolepsy", "cataplexy")
- OR("narcolepsy", "healthy")